Are male or female persons more prone to autoimmunity?

Sex hormones have long been implicated in autoimmune diseases because women account for 80% of cases.